Clinical trial exclusion criterion:
Prior or current use of any CCR5 antagonist (such as MVC and cenicriviroc [CVC]) and integrase inhibitor (such as RAL, DTG, and elvitegravir [EVG])

Entity relations:
- Subsumes("CCR5 antagonist", "MVC")
- Subsumes("integrase inhibitor", "RAL")
- Has_temporal("CCR5 antagonist", "Prior")
- OR("Prior", "current")
- OR("MVC", "cenicriviroc [CVC]")
- OR("RAL", "elvitegravir [EVG]", "DTG")
- OR("CCR5 antagonist", "integrase inhibitor")